¿Qué relación existe entre turbidimetría y nefelometría?
1. Nefelometría es la inversa de la turbidimetría.
2. La turbidimetría es más sensible que la nefelometría.
3. La nefelometría puede ser medida con un espectrofotómetro convencional.
4. Ambas tecnologías miden la dispersión de la luz.
5. Ambas tecnologías son las más sensibles y utilizadas en los laboratorios clínicos.

Respuesta correcta: 4. Ambas tecnologías miden la dispersión de la luz.